Clinical trial exclusion criterion:
History of morphine allergy

Annotated entities:
- Drug: "morphine"
- Condition: "allergy"
- Temporal: "History"